Clinical trial exclusion criterion:
The participant has received levodopa monotherapy, any psychoneurotic agent or antiemetic medication of dopamine agonist within 14 days. However, the participant has been receiving quetiapine or domperidone with a stable dose regimen for >= 14 days may be included in the study.

Annotated entities:
- Procedure: "levodopa monotherapy"
- Drug: "levodopa"
- Drug: "psychoneurotic agent"
- Drug: "antiemetic medication of dopamine agonist"
- Temporal: "within 14 days"
- Undefined_semantics: "antiemetic medication of dopamine agonist"
- Undefined_semantics: "psychoneurotic agent"
- Drug: "quetiapine"
- Drug: "domperidone"
- Qualifier: "stable dose"
- Temporal: ">= 14 days"